Acerca del tratamiento de la depresión en niños y adolescentes, señale la afirmación INCORRECTA:
1. En la depresión moderada a grave, la medicación antidepresiva sólo debe ofrecerse en combinación con una terapia psicológica simultánea.
2. Tanto la terapia cognitivo-conductual como la terapia interpersonal cuentan con sólidas evidencias de su eficacia en niños que aún no han llegado a la pubertad.
3. La autoayuda guiada y la terapia de apoyo no directiva son alternativas de tratamiento aceptables para la depresión leve.
4. La duración mínima de la terapia psicológica en la depresión moderada a grave debería ser de al menos 3 meses.
5. Tanto la terapia individual como la familiar son alternativas de tratamiento recomendables para la depresión moderada a grave.

Respuesta correcta: 2. Tanto la terapia cognitivo-conductual como la terapia interpersonal cuentan con sólidas evidencias de su eficacia en niños que aún no han llegado a la pubertad.